Clinical trial exclusion criterion:
Prolonged cardiopulmonary resuscitation (> 2 minutes) within the past 2 weeks

Entity relations:
- Has_qualifier("cardiopulmonary resuscitation", "Prolonged")
- Has_temporal("cardiopulmonary resuscitation", "past 2 weeks")